下列那一種細胞不能呈獻（presenting）胜肽（peptide）抗原給輔助型 T 細胞（helper T cells）？
A. B 細胞
B. 嗜中性白血球（neutrophils）
C. 巨噬細胞（macrophages）
D. 樹狀突出細胞（dendritic cells）

正確答案：B. 嗜中性白血球（neutrophils）